Clinical trial inclusion criterion:
A claimed prescription of a NOAC from a Danish pharmacy within 14 days of discharge or outpatient clinic visit.

Entity relations:
- multi("outpatient clinic visit", "outpatient clinic")
- Has_index("within 14 days of discharge or outpatient clinic visit", "discharge or outpatient clinic visit")
- multi("discharge or outpatient clinic visit", "discharge")
- Has_qualifier("NOAC", "Danish pharmacy")
- Has_temporal("NOAC", "within 14 days of discharge or outpatient clinic visit")
- AND("prescription", "NOAC")
- Has_qualifier("prescription", "claimed")
- OR("discharge", "outpatient clinic visit")